Clinical trial exclusion criterion:
20. Use of any investigational drug or therapy within 28 days before screening

Annotated entities:
- Parsing_Error: "20."
- Drug: "investigational drug"
- Procedure: "investigational therapy"
- Temporal: "within 28 days before screening"
- Reference_point: "screening"